化學療法引起之嚴重嘔吐，下列何種藥物最有效？
A. Bethanechol
B. Ondansetron
C. Scopolamine
D. Diphenhydramine

正確答案：B. Ondansetron